Cuál de las siguientes enzimas cataliza la fosforilación utilizando fosfato inorgánico:
1. Hexoquinasa.
2. Fosfofructoquinasa.
3. Gliceraldehído-3-fosfato deshidrogenasa.
4. Fosfoglicerato quinasa.
5. Piruvato quinasa.

Respuesta correcta: 3. Gliceraldehído-3-fosfato deshidrogenasa.